Clinical trial exclusion criterion:
Prior lung transplant, LVRS, median sternotomy, bullectomy or lobectomy.

Entity relations:
- Has_temporal("lung transplant", "Prior")
- OR("lung transplant", "bullectomy", "median sternotomy", "LVRS", "lobectomy")